cyclophosphamide,

The above is a clinical trial exclusion criterion. Annotated with entity spans:
[Drug: cyclophosphamide],